Clinical trial exclusion criterion:
Current pregnancy;

Entity relations:
- Has_temporal("pregnancy", "Current")